Which are the most under-represented oligonucleotides in higher eukaryote genomes?

The oligonucleotides containing the CG and TA dinucleotide are generally under-represented in higher eukaryote genomes